institutionalized patients; alcohol consumption >60 g/day

The above is a clinical trial exclusion criterion. Annotated with entity spans:
[Person: institutionalized] patients; [Observation: alcohol consumption] [Multiplier: >60 g/day]